Clinical trial exclusion criterion:
Uncontrolled diabetes defined as HbA1c above 70 mmol/mol and insufficient nutritional status.

Entity relations:
- Has_value("HbA1c", "above 70 mmol/mol")
- Subsumes("Uncontrolled diabetes", "HbA1c")
- Subsumes("Uncontrolled diabetes", "insufficient nutritional status")